To which disease does the loss of CD28 expression by liver-infiltrating T cells contribute?

loss of cd28 expression by liver-infiltrating t cells contributes to pathogenesis of primary sclerosing cholangitis.